1. Women and men ages 18 years and over.

The above is a clinical trial inclusion criterion. Annotated with entity spans:
1. [Person: Women] [Grammar_Error: and] [Person: men] [Person: ages] [Value: 18 years and over].